Clinical trial exclusion criterion:
diseases of red blood cells

Annotated entities:
- Condition: "diseases of red blood cells"